Clinical trial exclusion criterion:
Pregnant or lactating women.

Annotated entities:
- Condition: "Pregnant"
- Condition: "lactating"
- Person: "women"